Clinical trial exclusion criterion:
Other indication for intrapartum antibiotics (endocarditis prophylaxis, other known maternal infection)

Entity relations:
- AND("indication", "intrapartum antibiotics")
- Subsumes("indication", "endocarditis prophylaxis")
- OR("endocarditis prophylaxis", "maternal infection")